一位 65 歲身體狀況良好的女性病人，因鎖骨上窩處淋巴結腫大求醫，理學檢查淋巴結硬且固著；其他全部正常。下列何者是最不可能的診斷？
A. 惡性淋巴瘤
B. 鱗狀上皮細胞癌
C. 腺癌
D. 未分化細胞癌

正確答案：B. 鱗狀上皮細胞癌